Clinical trial exclusion criterion:
current infectious disease, and

Entity relations:
- Has_temporal("infectious disease", "current")